Clinical trial inclusion criterion:
Patients in whom a LEN-DEX-based treatment regimen is indicated

Annotated entities:
- Drug: "DEX"
- Drug: "LEN"
- Qualifier: "LEN-DEX-based"
- Procedure: "treatment regimen"
- Mood: "is indicated"